醣蛋白質（Glycoproteins）分子中，下列何種胺基酸可和糖基的部分（carbohydrate moiety）作共價鍵結合？
A. 天門冬素（asparagine）
B. 天門冬酸（aspartic acid）
C. 麩胺酸（glutamic acid）
D. 半胱胺酸（cysteine）

正確答案：A. 天門冬素（asparagine）